一位 65 歲之女性病人在三年半前因 Dukes' B 直腸癌接受低前位切除術治療，術後一年發生骨盆腔內左側壁之局部復發；經完整療程的放射線治療後一直在門診接受三個月一次的定期追蹤，並無任何自覺症狀，一切檢查包括血清 CEA 等也都正常。兩天前突然發現有大便經由陰道排出，則最可能是何種診斷？
A. 大腸憩室炎
B. 放射線性直腸炎及瘻管
C. 直腸癌復發
D. 異時性大腸直腸癌

正確答案：B. 放射線性直腸炎及瘻管